Subjects on any other experimental treatment within 90 days of the first dose of study drug or who have not recovered from the side effects of such therapy

The above is a clinical trial exclusion criterion. Annotated with entity spans:
[Post-eligibility: Subjects on any other experimental treatment within 90 days of the first dose of study drug or who have not recovered from the side effects of such therapy]